Cuando se lleva a cabo un diseño experimental, se busca fundamentalmente:
1. Conocer mejor la media de los resultados obtenidos y repetidos en un experimento.
2. Conocer mejor la mediana de los resultados obtenidos en un experimento.
3. Identificar mejor los factores que pueden afectar al experimento.
4. Identificar mejor las ecuaciones de regresión en un experimento.
5. Conocer mejor la desviación estándar de los diferentes datos en el experimento.

Respuesta correcta: 3. Identificar mejor los factores que pueden afectar al experimento.